Clinical trial exclusion criterion:
Concurrent antibiotherapy

Annotated entities:
- Drug: "antibiotherapy"
- Temporal: "Concurrent"